Clinical trial exclusion criteria:
severe coronary artery disease, heart failure, kidney failure
insulin-dependent DM (diabetes mellitus), poorly controlled type II DM
gastric/duodenal ulcer
allergy/contra-indication for any drug used in the study
corticosteroid use during last 3 months
preoperative use of opioid drugs (excl. codeine, tramadol)
neuropathy/sensory impairment of lower limbs
lack of co-operation, e.g. inability to use a PCA (patient controlled analgesia)-device

Annotated entities:
- Qualifier: "severe"
- Condition: "coronary artery disease"
- Condition: "heart failure"
- Condition: "kidney failure"
- Condition: "insulin-dependent DM"
- Condition: "diabetes mellitus"
- Qualifier: "poorly controlled"
- Condition: "type II DM"
- Condition: "gastric ulcer"
- Condition: "duodenal ulcer"
- Condition: "allergy"
- Condition: "contra-indication"
- Drug: "drug used in the study"
- Drug: "corticosteroid"
- Temporal: "during last 3 months"
- Temporal: "preoperative"
- Drug: "opioid drugs"
- Negation: "excl."
- Drug: "codeine"
- Drug: "tramadol"
- Condition: "neuropathy"
- Condition: "sensory impairment"
- Qualifier: "lower limbs"
- Observation: "lack of co-operation"
- Condition: "inability to use"
- Device: "PCA -device"